Clinical trial exclusion criterion:
regular consumption of medication with potential hepatotoxicity.

Annotated entities:
- Condition: "hepatotoxicity"
- Drug: "medication"